pain or other disorders precluding their participation.

The above is a clinical trial exclusion criterion. Annotated with entity spans:
[Post-eligibility: pain or other disorders precluding their participation].